Please list the tests used to diagnose Allergic Rhinitis.

Diagnosis of allergic rhinitis is made by a combination of medical history, physical examination, positive methacholine challenge result or bronchodilator responsiveness, determination of IgE-mediated sensitization, and specific inhalation challenge tests as the gold standard, specific IgE screening tests include  Skin prick test (SPT), Phadiatop, and nasal provocation test (NPT).